Clinical trial exclusion criterion:
Exclusion criteria include patients following resuscitation from cardiac arrest who are treated on the cooling protocol

Entity relations:
- Has_qualifier("resuscitation from cardiac arrest", "cooling protocol")